Clinical, laboratory, or biopsy evidence of cirrhosis

The above is a clinical trial exclusion criterion. Annotated with entity spans:
Clinical, laboratory, or biopsy evidence of [Condition: cirrhosis]